Clinical trial inclusion criterion:
Severe, symptomatic aortic stenosis,

Entity relations:
- Has_qualifier("aortic stenosis", "symptomatic")
- Has_qualifier("aortic stenosis", "Severe")